Clinical trial exclusion criterion:
Pregnant women and infants;

Entity relations:
- OR("Pregnant", "infants")
- OR("women", "infants")